下列器官中，最少受到腮腺炎病毒侵襲，所以無顯病理變化的是：
A. 肝臟
B. 中樞神經系統
C. 睪丸
D. 胰臟

正確答案：A. 肝臟